Clinical trial exclusion criterion:
Any concomitant cardiovascular procedure to CABG (i.e. valve, aortic or carotid surgery)

Entity relations:
- Has_temporal("cardiovascular procedure", "concomitant")
- Has_temporal("CABG", "concomitant")
- Subsumes("cardiovascular procedure", "valve surgery")
- OR("valve surgery", "aortic surgery", "carotid surgery")